Clinical trial exclusion criteria:
are allergic to influenza vaccination
have received influenza vaccination within the past 6 months
require prednisone, methotrexate, or other immunosuppressing medications
have HIV infection
have a history of solid organ or bone marrow transplant
require combination immunotherapy
are on other studies requiring blood draws that might exceed 450 mL total during the period of the influenza vaccine study

Annotated entities:
- Drug: "influenza vaccination"
- Condition: "allergic"
- Drug: "influenza vaccination"
- Temporal: "within the past 6 months"
- Drug: "prednisone"
- Drug: "methotrexate"
- Drug: "immunosuppressing medications"
- Qualifier: "other"
- Condition: "HIV infection"
- Procedure: "bone marrow transplant"
- Procedure: "solid organ transplant"
- Qualifier: "history"
- Procedure: "combination immunotherapy"
- Mood: "require"
- Competing_trial: "are on other studies requiring blood draws that might exceed 450 mL total during the period of the influenza vaccine study"